Clinical trial exclusion criteria:
1. Diagnosis: Diagnosis of CP secondary to neuronal migration.
2. Co-morbidities: Medical conditions that may prevent the administration of rehabilitation therapies at the intensity required by the study, or that may compromise the study ability to maintain blindness, or that have a co-morbidity not typically associated with CP (i.e. cancer, cystic fibrosis).
3. Co-interventions: Anticipated pharmacological intervention or procedure or participation in other studies that may interfere with this study.

Annotated entities:
- Parsing_Error: "1."
- Condition: "CP secondary to neuronal migration"
- Parsing_Error: "2."
- Undefined_semantics: "Co-morbidities: Medical conditions that may prevent the administration of rehabilitation therapies at the intensity required by the study, or that may compromise the study ability to maintain blindness, or that have a co-morbidity not typically associated with CP (i.e. cancer, cystic fibrosis)"
- Parsing_Error: "3."
- Post-eligibility: "Co-interventions: Anticipated pharmacological intervention or procedure or participation in other studies that may interfere with this study."
- Undefined_semantics: "Co-interventions: Anticipated pharmacological intervention or procedure or participation in other studies that may interfere with this study."